Clinical trial inclusion criteria:
White Brazilian of European descent
Fulfillment of the Diagnostic and Statistical Manual of Mental Disorders, Fourth Edition, (DSM-IV) diagnostic criteria for ADHD
Eligibility to immediate-release MPH (IR-MPH) treatment

Annotated entities:
- Person: "White"
- Person: "Brazilian"
- Person: "European descent"
- Qualifier: "Diagnostic and Statistical Manual of Mental Disorders, Fourth Edition, (DSM-IV) diagnostic criteria"
- Condition: "ADHD"
- Mood: "Eligibility"
- Drug: "immediate-release MPH (IR-MPH)"